Clinical trial exclusion criterion:
Congenital urogenital anomaly

Entity relations:
- Has_qualifier("urogenital anomaly", "Congenital")